What disease is associated with Anticitrullinated peptide antibodies (ACPAs)?

Anticitrullinated peptide antibodies (ACPAs) are associated with rheumatoid arthritis.